Patients who received anti-hair loss treatment within the past six months.

The above is a clinical trial exclusion criterion. Annotated with entity spans:
Patients who received [Procedure: anti-hair loss treatment] [Temporal: within the past six months].